下列為陣發性夜間血色素尿（paroxysmal nocturnal hemoglobinuria）的特徵，何者錯誤？
A. PIG-A gene mutation
B. hemolysis due to deficiency of CD16 and CD66 on RBC
C. complication of thrombosis
D. iron deficiency

正確答案：B. hemolysis due to deficiency of CD16 and CD66 on RBC